Current severe, uncontrolled systemic disease (eg, clinically significant cardiovascular, pulmonary, or metabolic disease; wound healing disorders; ulcers; or bone fractures).

The above is a clinical trial exclusion criterion. Annotated with entity spans:
Current [Qualifier: severe], [Qualifier: uncontrolled] [Condition: systemic disease] (eg, [Qualifier: clinically significant] [Condition: cardiovascular], [Condition: pulmonary], or [Condition: metabolic disease]; [Condition: wound healing disorders]; [Condition: ulcers]; or [Condition: bone fractures]).